Clinical trial inclusion criterion:
Metastatic invasive hormone receptor positive and HER2 negative breast cancer (histologically confirmed).

Entity relations:
- Has_qualifier("breast cancer", "invasive")
- Has_qualifier("breast cancer", "Metastatic")
- Has_qualifier("breast cancer", "hormone receptor positive")
- Has_qualifier("breast cancer", "HER2 negative")